某研究者想檢定來自北中	部的男大學生的平均身高是否一樣，在某大學隨機抽取來自北中	部男大學生各  名，下列統計分析方法何者最恰當？
A. Z檢定（Z test）
B. 變異數分析（ANOVA）
C. 配對t檢定（Paired t-test）
D. 列聯表分析（Contingency table）

正確答案：B. 變異數分析（ANOVA）